Cochlear implant

The above is a clinical trial exclusion criterion. Annotated with entity spans:
[Device: Cochlear implant]